The participant has unstable systemic disease.

The above is a clinical trial exclusion criterion. Annotated with entity spans:
The participant has [Qualifier: unstable] [Condition: systemic disease].